心臟衰竭的病人使用毛地黃（digitalis）治療時，下列敘述何者錯誤？
A. 可以降低住院率，並有效改善長期存活率
B. 要小心藥物交互作用的問題：quinidine, verapamil, amiodarone 均可能明顯地增加毛地黃的血中濃度
C. 要特別注意病人的血中鉀離子濃度，因為低血鉀（hypokalemia）會增加發生毛地黃中毒（digitalis intoxication）的風險
D. Dilantin（phenytoin）是一種抗癲癇藥物，它可以用於治療毛地黃中毒引起的心室心律不整（digitalis- induced ventricular arrhythmia）

正確答案：A. 可以降低住院率，並有效改善長期存活率